Clinical trial inclusion criterion:
8-22 weeks gestation

Annotated entities:
- Condition: "gestation"
- Multiplier: "8-22 weeks"